When did eptinezumab get its first FDA approval?

In February 2020, eptinezumab was approved in the USA for the preventive treatment of migraine in adults.